Which is the enzymatic activity of OTULIN?

OTULIN is a deubiquitinase, that specifically cleaves Met1-linked polyUb.